1. History of penetrating brain injury

The above is a clinical trial exclusion criterion. Annotated with entity spans:
1. [Temporal: History] of [Condition: penetrating brain injury]